Clinical trial inclusion criterion:
Healthy male volunteers, 18 to 45 years of age, inclusive. Healthy status is defined by absence of evidence of any active or chronic disease following a detailed medical and surgical history, a complete physical examination including vital signs, 12-lead ECG, hematology, blood chemistry, serology and urinalysis

Entity relations:
- Has_value("age", "18 to 45 years , inclusive")
- Has_negation("evidence of any active or chronic disease", "absence")
- Subsumes("Healthy", "evidence of any active or chronic disease")
- Subsumes("Healthy", "medical history")
- Subsumes("Healthy", "physical examination")
- Subsumes("Healthy", "vital signs")
- Subsumes("Healthy", "12-lead ECG")
- Subsumes("Healthy", "hematology")
- Subsumes("Healthy", "blood chemistry")
- Subsumes("Healthy", "serology")
- Subsumes("Healthy", "urinalysis")
- OR("medical history", "surgical history")